Traumatic vascular injuries or operative interventions (Surgical harvesting) involving arteries of the upper limb on the operative side.

The above is a clinical trial exclusion criterion. Annotated with entity spans:
[Condition: Traumatic vascular injuries] or [Procedure: operative interventions] ([Procedure: Surgical harvesting]) involving [Qualifier: arteries of the upper limb on the operative side].